Which is the main gene signature in Systemic Lupus Erythematosus (SLE)?

SLE is characterized by a type-I interferon gene signature.